Are negative for human immunodeficiency virus (HIV) infection at screening

The above is a clinical trial inclusion criterion. Annotated with entity spans:
Are [Negation: negative] for [Condition: human immunodeficiency virus (HIV)] infection [Temporal: at screening]